Clinical trial exclusion criterion:
Known clotting disorder or use of anticoagulants

Entity relations:
- AND("clotting disorder", "anticoagulants")